Age >18 years.

The above is a clinical trial inclusion criterion. Annotated with entity spans:
[Person: Age] [Value: >18 years].